Clinical trial exclusion criteria:
Co-infected with HCV, HIV or other viral hepatitis,
Diagnosis of HCC

Annotated entities:
- Condition: "HCV"
- Temporal: "Co-infected"
- Condition: "HIV"
- Qualifier: "other"
- Condition: "viral hepatitis"
- Condition: "HCC"